人類細胞之氧化磷酸化反應（oxidative phosphorylation）中，參與電子傳遞鏈（electron transport chain）與 ATP合成的酵素位於何處？
A. 電子傳遞鏈位於粒線體外膜；ATP合成的酵素位於粒線體內膜
B. 電子傳遞鏈位於粒線體內膜；ATP合成的酵素位於粒線體外膜
C. 皆位於粒線體外膜
D. 皆位於粒線體內膜

正確答案：D. 皆位於粒線體內膜